Adults over 18 years of age

The above is a clinical trial inclusion criterion. Annotated with entity spans:
[Person: Adults] [Value: over 18 years of age]